Platelet count < 75,000/ml

The above is a clinical trial exclusion criterion. Annotated with entity spans:
[Measurement: Platelet count] [Value: < 75,000/ml]